9. History of malignancies related to the NK cell line, including: NK cell leukemias and T-cell large granular lymphocyte leukemias, NK-cell lymphoproliferative disease of granular lymphocytes, and NK cell lymphomas, e.g., nasal and nasal-like NK/T-cell lymphomas.

The above is a clinical trial exclusion criterion. Annotated with entity spans:
9. [Temporal: History] of [Condition: malignancies] [Qualifier: related to the NK cell line], including: [Condition: NK cell leukemias] [Grammar_Error: and] [Condition: T-cell large granular lymphocyte leukemias], [Condition: NK-cell lymphoproliferative disease of granular lymphocytes], [Grammar_Error: and] [Condition: NK cell lymphomas], e.g., [Condition: nasal] [Grammar_Error: and] [Condition: nasal-like NK/T-cell lymphomas].